Clinical trial exclusion criterion:
contra-indication to inhalational induction (full stomach)

Annotated entities:
- Condition: "contra-indication"
- Procedure: "inhalational induction"
- Qualifier: "full stomach"